免疫反應攻擊自體組織細胞會產生免疫疾病。依照Coombs和Gell對免疫疾病的分類，下列那一項免疫反應該歸類為第一型的過敏反應（hypersensitivity）？
A. 全身性紅斑狼瘡的國中女生發生溶血性貧血
B. 十歲男童發現抗血小板抗體引起的牙齦流血傾向
C. 皮下注射過敏原三日後引起皮膚產生硬塊並發熱
D. 吸入風媒花花粉後馬上發生鼻塞和流眼淚

正確答案：D. 吸入風媒花花粉後馬上發生鼻塞和流眼淚